Evidence of abnormal liver function (serum ALT level(s) > 5 times upper limit of normal at screening or creatinine levels >2 times upper limit of normal at screening);

The above is a clinical trial exclusion criterion. Annotated with entity spans:
Evidence of [Value: abnormal] [Measurement: liver function] ([Measurement: serum ALT level(s)] [Value: > 5 times upper limit of normal] [Temporal: at screening] or [Measurement: creatinine levels] [Value: >2 times upper limit of normal] [Temporal: at screening]);